Clinical trial exclusion criterion:
Not have informed consent for the present clinical trial, or do not fully understand the meaning of informed consent.

Annotated entities:
- Post-eligibility: "Not have informed consent for the present clinical trial, or do not fully understand the meaning of informed consent"